Healthy postmenopausal women with 50 or more moderate to severe hot flushes.

The above is a clinical trial inclusion criterion. Annotated with entity spans:
[Condition: Healthy] [Condition: postmenopausal] [Person: women] with [Value: 50 or more] [Condition: moderate to severe hot flushes].